下列那一種症狀不應出現在腸躁症（irritable bowel syndrome）之病人？
A. 腹痛
B. 腹瀉
C. 體重減輕
D. 排便頻率改變

正確答案：C. 體重減輕